34 歲新婚婦女，2 年來月經異常出血，使用口服避孕藥治療，現在想要早點懷孕，超音波檢查有 7 公分子宮肌層內肌瘤，也造成骨盆腔壓痛，下列那一種治療最合適？
A. 使用 Gonadotropin-releasing hormone（GnRH）Agonist
B. 肌瘤切除手術
C. 子宮鏡加 D&C
D. 子宮動脈栓塞術

正確答案：B. 肌瘤切除手術